Clinical trial inclusion criterion:
Elderly patients over 65 years old exhibiting clinical indices of cardiovascular disease

Annotated entities:
- Person: "old"
- Value: "over 65 years"
- Person: "Elderly"
- Undefined_semantics: "clinical indices of cardiovascular disease"